signed informed consent

The above is a clinical trial inclusion criterion. Annotated with entity spans:
[Informed_consent: signed informed consent]